Clinical trial inclusion criterion:
aged 18 or older

Entity relations:
- Has_value("aged", "18 or older")